下列有關在進行常規（elective）大腸手術前，術前準備工作有新的觀念和看法，何者錯誤？
A. 進行bowel preparation時，有些病患會接受抗生素治療降低腸內菌量；大腸最常見的細菌是厭氧的
B. 有證據顯示術前施打抗生素，必須在劃刀前30分鐘內施打；若手術時間過長，需要每隔4小時再補抗生素劑
C. 若是臨床上考慮進行mechanical bowel cleansing，針對腎臟功能不佳的患者，選擇sodium phosphate類的灌腸劑，相對polyethylene glycol solution，較少發生嚴重電解質不平衡的情形
D. 近幾年關於fast track surgery的研究發現，常規長時間讓病患術前禁食，對於腸胃道排空功能正常患者，反而會有腸黏膜萎縮進而增加感染的機會

正確答案：C. 若是臨床上考慮進行mechanical bowel cleansing，針對腎臟功能不佳的患者，選擇sodium phosphate類的灌腸劑，相對polyethylene glycol solution，較少發生嚴重電解質不平衡的情形